Which genes are the main markers of primitive Endoderm (prEN) formation?

The main markers of primitive Endoderm (prEN) formation are fgf4, lrp2, gata4, pdgfra, p dgfrα, gATA6, nanog, pDgfralpha, egam1 and dab2.